Clinical trial exclusion criterion:
Cardiac morbidities

Annotated entities:
- Condition: "Cardiac morbidities"